Clinical trial exclusion criterion:
food allergy

Annotated entities:
- Condition: "food allergy"